Clinical trial inclusion criterion:
Total back pain as measured by visual analog scale (VAS) = 40 mm (0-100 mm) at baseline

Entity relations:
- Has_value("visual analog scale (VAS)", "= 40 mm")
- Has_temporal("visual analog scale (VAS)", "at baseline")
- AND("Total back pain", "visual analog scale (VAS)")